Psychiatrically stable enough to attend to completion (no hospitalisations or medication changes in last 4 weeks)

The above is a clinical trial inclusion criterion. Annotated with entity spans:
[Condition: Psychiatrically stable] enough to attend to completion ([Negation: no] [Procedure: hospitalisations] or [Observation: medication changes] [Temporal: in last 4 weeks])